Clinical trial inclusion criterion:
operating time varies 1-4h,and extubation after the operation.

Annotated entities:
- Measurement: "operating time"
- Value: "1-4h"
- Procedure: "extubation"
- Temporal: "after the operation"
- Reference_point: "the operation"
- Procedure: "operation"